Clinical trial exclusion criterion:
Tromboembolic event (CVA or transient ischemic attack, AMI) less than 3 months prior to the intravitreal injection of bevacizumab

Entity relations:
- Subsumes("Tromboembolic event", "CVA")
- AND("intravitreal injection", "bevacizumab")
- Has_index("less than 3 months prior to the intravitreal injection of bevacizumab", "the intravitreal injection of bevacizumab")
- multi("the intravitreal injection of bevacizumab", "intravitreal injection")
- Has_temporal("Tromboembolic event", "less than 3 months prior to the intravitreal injection of bevacizumab")
- OR("CVA", "AMI", "transient ischemic attack")